Clinical trial exclusion criterion:
Patients with a systemic or metabolic disorder leading to progressive bone deterioration

Entity relations:
- Has_qualifier("bone deterioration", "progressive")
- AND("bone deterioration", "systemic disorder")
- OR("systemic disorder", "metabolic disorder")